Name five popular  computer  programs used to identify genes in genomic sequences

Any five from the following not exhaustive list:  AUGUSTUS, MGENE, CRAIG, Agene, EUGENE,  Fgenesh++C, Fgenesh++,  Fgenesh, GeneID, GeneMark.hmm,  GENOMIX, GESECA, GLEAN,  GlimmerHMM, Gramene,JIGSAW, MAKER, ,MGENE, N-SCAN,  SGP2, SNAP,  ExonHunter, Evigan, Genescan, HMMGene, MZEF, Genie, Twinscan, SLAM, GRAIL.